Patients who test positive for HBsAg are ineligible

The above is a clinical trial inclusion criterion. Annotated with entity spans:
Patients who test [Value: positive] for [Measurement: HBsAg] [Grammar_Error: are ineligible]